The common house cat, Felis silvestris catus and the domestic dog, Canis familiaris both belong to what taxonomic order?

Domestic dogs and cats can be interpreted in terms of their descent from members of the order Carnivora.